Clinical trial inclusion criterion:
HbA1c = 6,5 % or fasting glycemia =7mmol/l or non-fasting glycemia =11mmol/l

Annotated entities:
- Measurement: "HbA1c"
- Value: "= 6,5 %"
- Measurement: "fasting glycemia"
- Value: "=7mmol/l"
- Measurement: "non-fasting glycemia"
- Value: "=11mmol/l"